登革熱疫情在最近幾年常於南部盛行，下列相關的敘述，何者最不可能？
A. 登革熱病毒一般可以分成四型
B. 臨床上常以發燒、頭痛、肌肉骨骼疼痛以及皮疹來表現
C. 在台灣的病媒蚊以埃及斑蚊和白線斑蚊為主
D. 實驗室檢查會出現血小板上升

正確答案：D. 實驗室檢查會出現血小板上升